切除迴腸後，對於膽鹽的影響，下列敘述何者正確？
A. 增加膽鹽在肝靜脈中濃度
B. 增加膽鹽在肝門脈中濃度
C. 增加膽鹽在膽囊中的儲存
D. 增加膽鹽在肝細胞中的合成

正確答案：D. 增加膽鹽在肝細胞中的合成